¿Qué constructo hace referencia al grado en que las personas son capaces de expresar compromiso, control y desafío en sus acciones, pensamientos y sentimientos?
1. Estrategias de afrontamiento.
2. Personalidad resistente.
3. Bienestar subjetivo.
4. Patrón de conducta Tipo A.
5. Extraversión.

Respuesta correcta: 2. Personalidad resistente.